Clinical trial inclusion criterion:
Normal uterine cavity (as assessed by hysteroscopy or HSG).

Entity relations:
- Has_value("uterine cavity", "Normal")
- Has_context("hysteroscopy", "uterine cavity")
- OR("hysteroscopy", "HSG")